Clinical trial exclusion criteria:
Indication for emergent cesarean or known fetal anomaly
Anti-hypertensive therapy received in the past 12 hours
History of eclampsia or other adverse CNS complication (e.g., stroke or PRES) in this pregnancy
Actively wheezing at time of enrollment or history of asthma complications
Known coronary artery disease or type I DM with microvascular complications or signs of heart failure or clinical dissection of the aorta

Annotated entities:
- Condition: "Indication"
- Procedure: "emergent cesarean"
- Condition: "fetal anomaly"
- Procedure: "Anti-hypertensive therapy"
- Temporal: "past 12 hours"
- Condition: "eclampsia"
- Condition: "CNS complication"
- Condition: "stroke"
- Condition: "PRES"
- Temporal: "in this pregnancy"
- Temporal: "at time of enrollment"
- Reference_point: "enrollment"
- Condition: "asthma complications"
- Condition: "wheezing"
- Condition: "coronary artery disease"
- Condition: "type I DM"
- Condition: "microvascular complications"
- Condition: "heart failure"
- Condition: "dissection of the aorta"